Low or intermediate risk level surgery

The above is a clinical trial inclusion criterion. Annotated with entity spans:
Low or [Procedure: intermediate risk level surgery]